Clinical trial inclusion criterion:
3. Patient treated by Eribulin between January and October 2014 (for the retrospective part) or between November 2014 and September 2015 (for the prospective part).

Annotated entities:
- Parsing_Error: "3."
- Drug: "Eribulin"
- Temporal: "between January and October 2014"
- Temporal: "between November 2014 and September 2015"